Clinical trial exclusion criterion:
Pregnant woman whose ultrasonographic examination reveals congenital anomaly of the fetus

Annotated entities:
- Condition: "Pregnant"
- Person: "woman"
- Procedure: "ultrasonographic examination"
- Value: "congenital anomaly of the fetus"